Clinical trial exclusion criterion:
Diagnosis of type 1 diabetes mellitus (DM) or uncontrolled DM (patients on insulin therapy or with HbA1c > 9%)

Entity relations:
- Has_qualifier("DM", "uncontrolled")
- Has_value("HbA1c", "> 9%")
- Subsumes("type 1 diabetes mellitus (DM)", "insulin therapy")
- OR("type 1 diabetes mellitus (DM)", "DM")
- OR("insulin therapy", "HbA1c")